依據世界衛生組織的統計，下列那一類疾病是目前人類社會 0 歲至 44 歲者的最主要死因？
A. 事故傷害
B. 傳染性疾病
C. 非傳染性疾病
D. 死產及出生後 1 週內死亡

正確答案：B. 傳染性疾病